Clinical trial exclusion criterion:
Diabetes mellitus or plasma glucose >11,1 at admission.

Annotated entities:
- Condition: "Diabetes mellitus"
- Measurement: "plasma glucose"
- Value: ">11,1"
- Temporal: "at admission"